下列有關腦性麻痺之敘述，何者錯誤？
A. 腦性麻痺兒童臨床之評估包含肌張力、反射、姿勢及不正常的運動表現
B. 一歲以前提早出現明顯的慣用手，需仔細評估是否可能係偏癱性腦性麻痺或是其他周邊神經損傷
C. 痙攣型單肢偏癱（spastic monoplegia）腦性麻痺臨床上最常見
D. 痙攣型四肢麻痺（spastic quadriplegia）病童常合併吞嚥困難

正確答案：C. 痙攣型單肢偏癱（spastic monoplegia）腦性麻痺臨床上最常見